Clinical trial exclusion criterion:
History of drug sensitivity or allergic reaction to alpha-blockers or beta-blockers

Entity relations:
- AND("drug sensitivity", "alpha-blockers")
- Has_temporal("drug sensitivity", "History")
- OR("alpha-blockers", "beta-blockers")
- OR("drug sensitivity", "allergic reaction")